Vulnerable patient populations including prisoners and institutionalized individuals.

The above is a clinical trial exclusion criterion. Annotated with entity spans:
Vulnerable patient populations including [Person: prisoners] and [Visit: institutionalized] individuals.